新生兒比大人更容易散失熱量，其原因是：
A. 心跳、呼吸速率較快
B. 體表面積與體重比值較高
C. 棕色脂肪代謝率較快
D. 血液甲狀腺素較高

正確答案：B. 體表面積與體重比值較高